History of clinically significant allergy or adverse event with protease inhibitors

The above is a clinical trial exclusion criterion. Annotated with entity spans:
History of clinically significant [Condition: allergy] or [Condition: adverse event] with [Drug: protease inhibitors]